Mantiene separadas las hebras del dúplex de DNA durante la replicación:
1. Primasa.
2. DNA ligasa.
3. Proteína SSB.
4. Helicasa.
5. DNA Polimerasa I.

Respuesta correcta: 3. Proteína SSB.